Clinical trial exclusion criterion:
Contraindications for magnetic resonance imaging

Annotated entities:
- Condition: "Contraindications"
- Procedure: "magnetic resonance imaging"